Está bien asociado con su función:
1. ARN ribosómico – procesamiento de preARN mensajero.
2. ARN mensajero – unión a aminoácido.
3. MicroARN – inhibición de la traducción del ARN mensajero.
4. ARN de transferencia – componente estructural del ribosoma.
5. ARN de interferencia pequeño - procesamiento del ARN ribosómico.

Respuesta correcta: 3. MicroARN – inhibición de la traducción del ARN mensajero.